一位 65 歲男性病人，因貧血就診，大腸鏡發現上升結腸有腫瘤，切片病理報告為腺癌，電腦斷層檢查顯示多處肝轉移，經右半結腸切除，發現腸繫膜淋巴結也有癌細胞侵犯，肝轉移目前無法切除，分期為 T3N2M1 ， 腫瘤基因檢測： K-ras 基因有 G12D 突變，術後除化學治療外會建議加何種標靶治療以期待肝轉移變為可切除？
A. EGFR抑制劑
B. 血管增生抑制劑
C. EGFR抑制劑+血管增生抑制劑
D. EGFR抑制劑或血管增生抑制劑皆不使用，因二者都沒效

正確答案：B. 血管增生抑制劑